Según la teoría freudiana sobre la estructura de la personalidad, la única instancia mental innata es:
1. El preconsciente.
2. El YO.
3. El Ello.
4. El Super-yo.

Respuesta correcta: 3. El Ello.